Chest x-ray, computerized tomography (CT) scan, or chest magnetic resonance imaging (MRI) with evidence of ongoing infectious or malignant process, obtained within 3 months prior to screening and evaluated by a qualified physician.

The above is a clinical trial inclusion criterion. Annotated with entity spans:
[Procedure: Chest x-ray], [Procedure: computerized tomography (CT) scan], or [Procedure: chest magnetic resonance imaging (MRI)] with evidence of [Temporal: ongoing] [Condition: infectious] or [Condition: malignant process], obtained [Temporal: within 3 months prior to screening] and evaluated by a qualified physician.